List RNA modifications databases

RMBase and MODOMICS